Clinical trial inclusion criterion:
For melanoma patients, If patients have a history of malignancy other than melanoma, and other skin cancers in the past five years, their inclusion is up to the discretion of the physician.

Entity relations:
- Has_negation("melanoma", "other than")
- Has_temporal("skin cancers", "in the past five years")
- AND("malignancy", "melanoma")
- Has_temporal("malignancy", "history")
- Has_temporal("skin cancers", "history")
- OR("malignancy", "skin cancers")